Resting bradycardia (< 50 beats/min), frequent multifocal PVCs, complex ventricular arrhythmia, sustained SVT

The above is a clinical trial exclusion criterion. Annotated with entity spans:
[Condition: Resting bradycardia] ([Value: < 50 beats/min]), [Multiplier: frequent] [Condition: multifocal PVCs], [Condition: complex ventricular arrhythmia], [Condition: sustained SVT]